目前台灣地區仍是日本腦炎的流行區，請問台灣地區傳播日本腦炎之病媒為何？
A. 矮小瘧蚊（Anopheles minimus）
B. 白線斑蚊（Aedes albopictus）
C. 埃及斑蚊（Aedes aegypti）
D. 三斑家蚊（Culex tritaeniorhynchus）

正確答案：D. 三斑家蚊（Culex tritaeniorhynchus）